Clinical trial exclusion criterion:
History of three or more consecutively failed In Vitro Fertilization (IVF) cycles after embryo transfer

Entity relations:
- Subsumes("In Vitro Fertilization", "IVF")
- AND("embryo transfer", "embryo transfer")
- Has_index("after embryo transfer", "embryo transfer")
- Has_qualifier("In Vitro Fertilization", "consecutively failed")
- Has_multiplier("In Vitro Fertilization", "three or more")
- Has_temporal("In Vitro Fertilization", "after embryo transfer")